Which company developed Waylivra?

Waylivra is being developed by Ionis Pharmaceuticals through its subsidiary company, Akcea Therapeutics.